Renal failure (Cl Cr < 60 mL /min /1,73m),

The above is a clinical trial exclusion criterion. Annotated with entity spans:
[Condition: Renal failure] ([Measurement: Cl Cr] [Value: < 60 mL /min /1,73m]),